下列有關 deep vein thrombosis（DVT）的敘述，何者錯誤？
A. 懷疑有 DVT，應該儘快確定診斷，儘早開始使用抗凝血劑治療
B. DVT 的病人 D-dimer 檢查多為陽性
C. compression ultrasound with Doppler 的檢查可作為診斷依據
D. 一般較常發生在上肢靜脈

正確答案：D. 一般較常發生在上肢靜脈